Clinical trial inclusion criterion:
Clinically and angiographically stable CAD who requires CABG as part of the standard medical care, as CAD does not represent a contraindication for using liraglutide. The stability of the CAD further warranties that study patients will not be exposed to higher risk by using liraglutide

Annotated entities:
- Qualifier: "angiographically stable"
- Condition: "CAD"
- Procedure: "CABG"
- Mood: "requires"
- Qualifier: "Clinically stable"
- Non-representable: "as CAD does not represent a contraindication for using liraglutide. The stability of the CAD further warranties that study patients will not be exposed to higher risk by using liraglutide"